Post-traumatic or post surgery of lower extremity

The above is a clinical trial exclusion criterion. Annotated with entity spans:
[Temporal: Post-traumatic] or [Temporal: post surgery of lower extremity]